Clinical trial exclusion criterion:
Evidence of congenital heart disease

Annotated entities:
- Condition: "congenital heart disease"
- Mood: "Evidence of"